Clinical trial exclusion criterion:
Maintenance or prophylactic therapy for stable medical conditions.

Annotated entities:
- Non-query-able: "Maintenance or prophylactic therapy for stable medical conditions"